Clinical trial exclusion criterion:
Inmate of a correctional facility (i.e. prisoners).

Annotated entities:
- Person: "Inmate of a correctional facility"
- Person: "prisoners"